Patients must have undergone segmental mastectomy (i.e., lumpectomy).

The above is a clinical trial inclusion criterion. Annotated with entity spans:
Patients must have undergone [Procedure: segmental mastectomy] (i.e., [Procedure: lumpectomy]).